Subject with an abnormal karyotype in favor of Turner syndrome or having a premutation of the FMR1 gene or a syndromic form

The above is a clinical trial exclusion criterion. Annotated with entity spans:
Subject with an [Condition: abnormal karyotype] in favor of [Condition: Turner syndrome] or having a [Condition: premutation of the FMR1 gene] or a [Condition: syndromic form]